Clinical trial exclusion criterion:
Any intraocular inflammation in the study eye present during the screening slit lamp examination

Entity relations:
- Has_value("slit lamp examination", "intraocular inflammation")
- Has_temporal("slit lamp examination", "during the screening slit lamp examination")
- Has_index("during the screening slit lamp examination", "the screening slit lamp examination")